14歲的小鐘因出生時發生周產期窒息，導致腦部嚴重受傷，對外界的反應只是少許的身體扭動及喉頭模糊不 清的聲音，十幾年來此種狀況無明顯改變。他的父母因年老無法再照顧他，3年前將他遷入重殘機構照顧。兩天前於鼻胃管餵食後數小時出現呼吸急促現象，機構特約醫師給予口服藥物治療後情況仍未改善，機構護理人員緊急將他送到醫院，你在急診室為他做相關的檢查，發現他兩側嚴重肺炎，血液氣體分析顯示嚴重呼吸衰竭，需緊急做氣管插管使用呼吸器。但無法聯繫上他的父母，而小鐘的情況於使用氧氣及鼻式正壓裝置後
 未見改善，且出現低血壓現象，此時下列那一種作法最為恰當？
A. 持續聯繫他的父母及繼續目前的治療，但不插管
B. 請送小鐘來的機構護理人員做決定
C. 打電話給機構負責人請他做決定
D. 依照你的專業判斷給他做氣管插管及使用呼吸器

正確答案：D. 依照你的專業判斷給他做氣管插管及使用呼吸器